Age between 1 month and 24 months of age (not beyond second birthday at baseline).

The above is a clinical trial inclusion criterion. Annotated with entity spans:
[Person: Age] [Value: between 1 month and 24 months of age] (not beyond second birthday at baseline).